Which is the primary interacting protein of BLK?

A The genes BANK1 and BLK were recently described as associated with SLE